El Cuadro de Mando es:
1. El conjunto de normas que rigen el funcionamiento interno de una institución.
2. Un conjunto de datos e indicadores, que sirve como instrumento de información y control para la gestión.
3. La relación de los nombres y cargos del Comité Directivo de una institución.
4. Un panel de control, utilizado por los Directores de instituciones, que les permite acceder a todos los servicios y aplicaciones electrónicas en línea.
5. Un informe económico-financiero, que permite conocer básicamente las desviaciones de los gastos e ingresos de una institución.

Respuesta correcta: 2. Un conjunto de datos e indicadores, que sirve como instrumento de información y control para la gestión.